Clinical trial exclusion criterion:
Presence of such complications as SBP, or hepatic encephalopathy(West Haven grade = 3)

Entity relations:
- Has_value("West Haven grade", "= 3")
- AND("hepatic encephalopathy", "West Haven grade")
- Subsumes("complications", "SBP")
- OR("SBP", "hepatic encephalopathy")